一位67歲女性因為雙下肢刺痛感（tingling sensation）來診，理學檢查：雙腳趾空間位置感（positional sensation）及雙下肢震動感（vibratory sensation）降低，她最有可能缺乏下列那種維他命？
A. A
B. B12
C. C
D. E

正確答案：B. B12